Known bleeding disorder (e.g,. dysfibrinogenemia, factor IX deficiency, hemophilia, Von Willebrand's disease, disseminated intravascular coagulation (DIC), fibrinogen deficiency, or clotting factor deficiency)

The above is a clinical trial exclusion criterion. Annotated with entity spans:
Known [Condition: bleeding disorder] (e.g,. [Condition: dysfibrinogenemia], [Condition: factor IX deficiency], [Condition: hemophilia], [Condition: Von Willebrand's disease], [Condition: disseminated intravascular coagulation] ([Condition: DIC]), [Condition: fibrinogen deficiency], or [Condition: clotting factor deficiency])